Clinical trial inclusion criterion:
Ability to understand and willingness to sign a written informed consent document

Annotated entities:
- Non-query-able: "Ability to understand and willingness to sign a written informed consent document"